Clinical trial exclusion criterion:
Patient works for OOO "NPF "MATERIA MEDICA HOLDING" (i.e., is the company's employee, temporary contract worker or appointed official responsible for carrying out the research or their immediate family).

Entity relations:
- Has_context("appointed official", "responsible for carrying out the research or their immediate family")
- Subsumes("works for OOO "NPF "MATERIA MEDICA HOLDING"", "company's employee")
- OR("company's employee", "appointed official", "temporary contract worker")